Clinical trial inclusion criterion:
HBsAg-positive for more than 6 months (HBeAg-positive or HBeAg-negative).

Entity relations:
- Has_value("HBsAg", "positive")
- Has_temporal("HBsAg", "more than 6 months")
- Has_value("HBeAg", "positive")
- Has_value("HBeAg", "negative")
- OR("HBeAg", "HBeAg")